Clinical trial inclusion criterion:
Age: 60-85 years, right-handed;

Entity relations:
- Has_value("Age", "60-85 years")